History of hypersensitivity reactions to murine protein-containing products.

The above is a clinical trial exclusion criterion. Annotated with entity spans:
History of [Condition: hypersensitivity reactions] to [Drug: murine protein-containing products].